Clinical trial inclusion criterion:
Patients who have taken more than one anti-TNFa agent

Annotated entities:
- Multiplier: "more than one"
- Drug: "anti-TNFa agent"